Clinical trial inclusion criterion:
Community in a school district that is within the study area

Annotated entities:
- Visit: "school district that is within the study area"